有關 GOLD guideline 中 COPD 之分期及治療，下列何者錯誤？
A. FEV1/FVC＜70%且 50%≦FEV1＜80%預測值，為 stage II, moderate COPD
B. FEV1/FVC＜70%且 30%≦FEV1＜50%預測值，為 stage III, severe COPD
C. 吸入性類固醇在 FEV1＜50%且常有急性發作之患者，可規則長期使用
D. 對於 FEV1＜30%預測值之穩定期 COPD 患者，可長期使用低劑量之口服類固醇來減少發作之次數

正確答案：D. 對於 FEV1＜30%預測值之穩定期 COPD 患者，可長期使用低劑量之口服類固醇來減少發作之次數